Clinical trial inclusion criterion:
5. Age ≥18 years

Entity relations:
- Has_value("Age", "≥18 years")